only occlusal and/or occlusal-proximal surfaces with caries lesions with dentin involvement

The above is a clinical trial inclusion criterion. Annotated with entity spans:
only [Qualifier: occlusal] and/or [Qualifier: occlusal-proximal surfaces] with [Condition: caries lesions] with [Condition: dentin involvement]